Los principales mediadores de la citotoxicdiad celular dependiente de anticuerpos son:
1. Los esosinófilos.
2. Los linfocitos NK.
3. Los mastocitos.
4. Los neutrófilos.
5. Los linfocitos CD8+.

Respuesta correcta: 2. Los linfocitos NK.